Which tools have been developed for identifying and visualising ncRNA promoters?

Epd, ncpro-ml and ucsc genome browser are tools that have been developed for identifying and visualising ncRNA promoters.